Known platelets < 100.000/µl or known hemorrhagic diathesis

The above is a clinical trial exclusion criterion. Annotated with entity spans:
Known [Measurement: platelets] [Value: < 100.000/µl] or known [Condition: hemorrhagic diathesis]